Clinical trial exclusion criterion:
signs of complicated UTI (e. g. temperature > 38°C, loin tenderness)

Annotated entities:
- Condition: "complicated UTI"
- Condition: "loin tenderness"
- Measurement: "temperature"
- Value: "> 38°C"